¿Con qué autor se asocia el desarrollo y evaluación de la terapia cognitivo-conductual en grupo como tratamiento de referencia (gold standard) para la fobia social?
1. Clark.
2. Wells.
3. Hayes.
4. Beck.
5. Heimberg.

Respuesta correcta: 5. Heimberg.